Clinical trial inclusion criteria:
Diagnosis of sickle cell disease
Clinically significant disease defined as at least 1 painful episode per year averaged over the previous 3 years or a history of priapism, stroke, acute chest syndrome, avascular necrosis, multi-organ failure or the need for chronic narcotic medications for pain from sickle cell disease
Must have failed a previous attempt at treatment with hydroxyurea defined as the inability to achieve a significant absolute increase in % fetal hemoglobin or the inability to tolerate hydroxyurea treatment due to severe side effects such as but not limited to myelosuppression, gastrointestinal symptoms, edema or hepatic enzyme elevations or have contraindications to hydroxyurea
18 years of age or older
Hematologic laboratory values as outlined in the protocol
Non-hematologic laboratory values as outlined in the protocol
Must agree not to donate blood or other bodily fluid while taking the study drug and for 28 days thereafter
Women of child-bearing potential (WCBP) must have a negative serum pregnancy test 72 hours or less prior to starting treatment
Women of child-bearing potential and men must agree to use 2 forms of adequate contraception prior to study entry and for the duration of study participation

Annotated entities:
- Condition: "sickle cell disease"
- Mood: "Diagnosis"
- Qualifier: "Clinically significant"
- Condition: "Clinically significant disease"
- Multiplier: "per year averaged over the previous 3 years at least 1"
- Condition: "painful episode"
- Temporal: "the previous 3 years"
- Qualifier: "averaged over the previous 3 years"
- Temporal: "history"
- Condition: "priapism"
- Condition: "stroke"
- Condition: "acute chest syndrome"
- Condition: "avascular necrosis"
- Condition: "multi-organ failure"
- Mood: "need for"
- Multiplier: "chronic"
- Qualifier: "chronic"
- Drug: "narcotic medications"
- Condition: "pain"
- Condition: "sickle cell disease"
- Non-representable: "Must have failed a previous attempt at treatment with hydroxyurea defined as the inability to achieve a significant absolute increase in % fetal hemoglobin or the inability to tolerate hydroxyurea treatment due to severe side effects such as but not limited to myelosuppression, gastrointestinal symptoms, edema or hepatic enzyme elevations or have contraindications to hydroxyurea"
- Value: "18 years or older"
- Person: "age"
- Non-representable: "Hematologic laboratory values as outlined in the protocol"
- Context_Error: "Hematologic laboratory values as outlined in the protocol"
- Context_Error: "Non-hematologic laboratory values as outlined in the protocol"
- Non-representable: "Non-hematologic laboratory values as outlined in the protocol"
- Procedure: "donate blood"
- Negation: "not"
- Mood: "Must agree to"
- Procedure: "donate bodily fluid"
- Temporal: "while taking the study drug"
- Reference_point: "taking the study drug"
- Drug: "study drug"
- Temporal: "for 28 days thereafter"
- Condition: "child-bearing potential"
- Person: "Women"
- Person: "WCBP"
- Measurement: "serum pregnancy test"
- Value: "negative"
- Temporal: "72 hours or less prior to starting treatment"
- Reference_point: "starting treatment"
- Procedure: "treatment"
- Pregnancy_considerations: "Women of child-bearing potential (WCBP) must have a negative serum pregnancy test 72 hours or less prior to starting treatment"
- Condition: "child-bearing potential"
- Person: "Women"
- Person: "men"
- Mood: "must agree to"
- Multiplier: "2 forms"
- Procedure: "contraception"
- Qualifier: "adequate"
- Temporal: "prior to study entry"
- Temporal: "for the duration of study participation"
- Reference_point: "study participation"
- Reference_point: "study entry"